2. Past or current history of neoplasm other than the entry diagnosis, with the exception of treated non-melanoma skin cancer or carcinoma in-situ of any primary site, or invasive cancers treated definitively, with treatment ending >5 years previously and no evidence of recurrences.

The above is a clinical trial exclusion criterion. Annotated with entity spans:
2. [Temporal: Past] or [Temporal: current] [Temporal: history] of [Condition: neoplasm] [Qualifier: other than the entry diagnosis], [Negation: with the exception of] [Procedure: treated] [Condition: non-melanoma skin cancer] or [Condition: carcinoma in-situ] of any primary site, or [Qualifier: invasive] [Condition: cancers] [Qualifier: treated definitively], with treatment ending [Temporal: >5 years previously] and [Negation: no] [Observation: evidence of recurrences].